¿Cuál es el mecanismo de acción de erlotinib?:
1. Es un bloqueante de canales de Na+.
2. Actúa como agonista inverso del receptor GABAA.
3. Es un inhibidor de tirosina-quinasas asociadas al receptor del factor de crecimiento epidérmico.
4. Es un antagonista del receptor del factor de crecimiento epidérmico.

Respuesta correcta: 3. Es un inhibidor de tirosina-quinasas asociadas al receptor del factor de crecimiento epidérmico.